Aumenta la actividad de la Na+/K+-ATPasa:
1. Insulina.
2. Aldosterona.
3. ACTH.
4. Péptido atrial natriurético.
5. ADH.

Respuesta correcta: 2. Aldosterona.